Clinical trial exclusion criterion:
Irritable bowel syndrome (Rome-IV criteria for irritable bowel syndrome)

Annotated entities:
- Condition: "Irritable bowel syndrome"
- Measurement: "Rome-IV criteria"
- Condition: "irritable bowel syndrome"